Covered by the French social care system

The above is a clinical trial inclusion criterion. Annotated with entity spans:
[Observation: Covered by the French social care system]